Patients between 3 to 16 years of age undergoing adenotonsillectomy, with or without myringotomy or myringoplasty

The above is a clinical trial inclusion criterion. Annotated with entity spans:
Patients [Value: between 3 to 16 years] of [Person: age] [Temporal: undergoing] [Procedure: adenotonsillectomy], with or without [Procedure: myringotomy] or [Procedure: myringoplasty]